Clinical trial exclusion criterion:
HEALTHY: known cardiovascular disease, cardiac risk factors or use of cardiac medications

Annotated entities:
- Condition: "HEALTHY"
- Condition: "cardiovascular disease"
- Condition: "cardiac risk factors"
- Drug: "cardiac medications"